Clinical trial inclusion criterion:
Patients with endometrial or epithelial ovarian cancer who following routine clinical guidelines are offered weekly taxane (paclitaxel) treatment. This will often be a third or fourth line treatment, i.e. patients with advanced disease.

Annotated entities:
- Condition: "epithelial ovarian cancer"
- Condition: "endometrial ovarian cancer"
- Multiplier: "weekly"
- Drug: "taxane"
- Drug: "paclitaxel"
- Procedure: "treatment"
- Non-representable: "This will often be a third or fourth line treatment, i.e. patients with advanced disease."